下列資料是 6 隻長有癌細胞老鼠，經過放射線治療後的存活時間（月）：1.4, 1.7, 2.3, 2.5, 3.2 和 3.8。 8 這筆資料在記錄時，被錯誤地記為 38，下列那一個敘述對統計量的影響是正確的？
A. 中位數增加
B. 眾數增加
C. 平均值增加
D. 中位數和平均值同時增加

正確答案：C. 平均值增加